有一位免疫缺損的病患，他的吞噬細胞的細胞游走正常，吞噬細菌的能力也優良，但吞噬後無法將細菌殺死而經常引起明顯的組織發炎反應。下列疾病何者合乎這個敘述？
A. 白血球黏	缺損（leukocyte adhesion deficiency）
B. 慢性肉芽腫病（chronic granulomatous disease）
C. Wiskott-Aldrich syndrome
D. DiGeorge syndrome

正確答案：B. 慢性肉芽腫病（chronic granulomatous disease）